有關兒童青少年憂鬱疾患（depressive disorders），下列敘述何者錯誤？
A. 可能以易怒（irritable）而非憂鬱情緒來表現
B. 即使體重未明顯下降，也可能是以體重增加未達正常速度來表現
C. 要診斷低落性情感疾患（dysthymic disorder），症狀須維持兩年以上
D. 預後會受到發病年齡、嚴重度、合併的精神疾病之影響

正確答案：C. 要診斷低落性情感疾患（dysthymic disorder），症狀須維持兩年以上